Clinical trial exclusion criterion:
Focal laser photocoagulation or intravitreal/periocular steroids of any type in the study eye within the last 90 days prior to study enrollment.

Annotated entities:
- Procedure: "Focal laser photocoagulation"
- Drug: "intravitreal/periocular steroids"
- Qualifier: "in the study eye"
- Temporal: "within the last 90 days prior to study enrollment"
- Reference_point: "study enrollment"